What is hyperosmia

increased olfactory acuity